抑制真菌 DNA 及 RNA 合成之抗真菌藥物為何？
A. Terbinafine
B. Amphotericin B
C. Flucytosine
D. Fluconazole

正確答案：C. Flucytosine